Clinical trial exclusion criterion:
The other types of pulmonary hypertension.

Annotated entities:
- Condition: "pulmonary hypertension"
- Qualifier: "other types"